Known allergies to any of the study medications by participant self-report

The above is a clinical trial exclusion criterion. Annotated with entity spans:
[Non-query-able: Known allergies to any of the study medications by participant self-report]